Los riñones secretan la hormona:
1. Calcitriol.
2. Renina.
3. Angiotensina II.
4. Aldosterona.
5. Calcitonina.

Respuesta correcta: 1. Calcitriol.